下列何項藥物不會造成高離子間隙（high anion gap）代謝性酸中毒？
A. Ethylene glycol
B. Hippurate
C. Methanol
D. Salicylate

正確答案：B. Hippurate